Clinical trial inclusion criterion:
SCI above L5

Annotated entities:
- Measurement: "SCI"
- Value: "above L5"